Cognitive behavioural therapy or additional psychotherapy in past four months

The above is a clinical trial exclusion criterion. Annotated with entity spans:
[Procedure: Cognitive behavioural therapy] or [Qualifier: additional] [Procedure: psychotherapy] [Temporal: in past four months]